Clinical trial exclusion criterion:
Umbilical hernia

Annotated entities:
- Condition: "Umbilical hernia"